下列關於目前全民健保部分負擔制度之敘述，何者正確？
A. 不鼓勵轉診
B. 持慢性病連續處方箋可免藥品部分負擔
C. 住院採定額部分負擔
D. 門診採定率部分負擔

正確答案：B. 持慢性病連續處方箋可免藥品部分負擔